Planned non-cardiac surgery at least after 12 months of implantation of drug eluting stent

The above is a clinical trial inclusion criterion. Annotated with entity spans:
[Mood: Planned] [Condition: non-cardiac surgery] [Temporal: at least after 12 months of implantation of drug eluting stent]